病媒蜱（tick）目前仍是許多感染症之病媒，下列何種感染症不是經由病媒蜱所傳播？
A. 巴貝氏原蟲症（babesiosis）
B. 艾利克次體症（ehrlichiosis）
C. 萊姆病（Lyme disease）
D. 戰壕熱（trench fever）

正確答案：D. 戰壕熱（trench fever）